Contraindications for spinal anesthesia (like bleeding diathesis or regional infection at site of neuroaxial block)

The above is a clinical trial exclusion criterion. Annotated with entity spans:
[Condition: Contraindications] for [Procedure: spinal anesthesia] (like [Condition: bleeding diathesis] or [Condition: regional infection] at [Qualifier: site of neuroaxial block])